肩胛骨下角（inferior angle）相對於第幾胸椎的棘突？
A. 二
B. 三
C. 五
D. 七

正確答案：D. 七